Subjects with severe kidney disease

The above is a clinical trial exclusion criterion. Annotated with entity spans:
Subjects with [Qualifier: severe] [Condition: kidney disease]